60 歲王女士，育有一男二女，二個月前被診斷出子宮頸癌合併腹腔多處轉移，經化學治療及放射線治療後，腫瘤仍然持續增生，此次因為已連續數日嚴重下腹部疼痛而住院治療，疼痛性質為下腹部悶痛、脹痛且為持續性的劇痛，無法因姿勢改變而緩解。下列治療及評估方式中，何者最為適當？
A. 因患者持續強烈疼痛，應馬上給予最強的止痛藥，如 fentanyl 貼片
B. 直接給予單次的 meperidine 注射，再視未來疼痛情形給予單次的 meperidine
C. 先評估是否有內出血等急症，然後再依據世界衛生組織（WHO）的三階段止痛法予以止痛
D. 因止痛藥物會影響未來診斷及治療，不應先給予止痛藥，而應等所有的檢查及診斷確定後再考慮給予治療

正確答案：C. 先評估是否有內出血等急症，然後再依據世界衛生組織（WHO）的三階段止痛法予以止痛